La glucolisis hepática se diferencia de la glucolisis muscular en que:
1. Una baja concentración de glucosa en sangre produce la inhibición de la piruvato quinasa hepática pero no de la muscular.
2. La hexoquinasa hepática tiene más afinidad por la glucosa que la hexoquinasa muscular.
3. Las enzimas glucolíticas en el hígado se localizan en el citoplasma, mientras que en el músculo están en citoplasmas y mitocondrias.
4. La glucolisis hepática es anaerobia, mientras que la glucolisis muscular es aerobia.
5. El producto final de la glucolisis hepática es acetil-CoA, mientras que en la glucolisis muscular ese piruvato.

Respuesta correcta: 1. Una baja concentración de glucosa en sangre produce la inhibición de la piruvato quinasa hepática pero no de la muscular.